Clinical trial inclusion criterion:
Acute symptomatic BV

Entity relations:
- Has_qualifier("BV", "symptomatic")
- Has_temporal("BV", "Acute")